Clinical trial exclusion criterion:
HbA1c greater than 75 mmol/mol (9.0%)

Annotated entities:
- Measurement: "HbA1c"
- Value: "greater than 75 mmol/mol"
- Value: "9.0%"